Clinical trial exclusion criterion:
Generalized pain or fibromyalgia;

Entity relations:
- OR("Generalized pain", "fibromyalgia")